Newly started hormone therapy within the last 6 months

The above is a clinical trial exclusion criterion. Annotated with entity spans:
[Multiplier: Newly started] [Procedure: hormone therapy] [Temporal: within the last 6 months]